Clinical trial inclusion criterion:
Adequate Contraception

Annotated entities:
- Procedure: "Contraception"
- Qualifier: "Adequate"
- Undefined_semantics: "Adequate"
- Subjective_judgement: "Adequate"